Clinical trial inclusion criterion:
ECOG Performance Status of 0 or 1.

Entity relations:
- Has_value("ECOG Performance Status", "0 or 1")